¿Cuál es el diagnóstico más probable de un recién nacido con microcefalia, retraso del crecimiento intrauterino, cardiopatía congénita, pie astrágalo vertical y una facies peculiar (microftalmia, hendiduras palpebrales pequeñas, micrognatia y orejas displásicas), las manos con el dedo índice y meñique sobre el medio y anular?
1. Trisomía 18. (Síndrome de Edwards).
2. Trisomía 13. (Sindrome de Patau).
3. Trisomía 21. (Síndrome de Down).
4. Trisomía 9.

Respuesta correcta: 1. Trisomía 18. (Síndrome de Edwards).